Known to be human immunodeficiency virus positive

The above is a clinical trial exclusion criterion. Annotated with entity spans:
Known to be [Condition: human immunodeficiency virus positive]